青黴素（penicillin）的殺菌作用是因為它能抑制下列何種酵素的活性？
A. 內醯胺酶（β-lactamase）
B. 轉肽基酶（transpeptidase）
C. 接合酶（ligase）
D. 醛縮酶（aldolase）

正確答案：B. 轉肽基酶（transpeptidase）